下列有關擴大型心肌病（dilated cardiomyopathy）的敘述，何者錯誤？
A. 10～40% AIDS 病人會有擴大型心肌病
B. 每天酗酒 5 至 10 年後約有 10% 發生心衰竭
C. 絕大部分的週產期心肌病（peripartum cardiomyopathy）不會復原
D. Interferon-alpha 治療肝炎亦可造成擴大型心肌病

正確答案：C. 絕大部分的週產期心肌病（peripartum cardiomyopathy）不會復原